Clinical trial inclusion criterion:
NOSE score greater than 55

Annotated entities:
- Measurement: "NOSE score"
- Value: "greater than 55"